Clinical trial exclusion criterion:
persistent pain for other reason

Annotated entities:
- Condition: "persistent pain"
- Qualifier: "other reason"